下列有關利用肝穿刺診斷各種病毒性肝炎相關之肝臟疾病的敘述，何者錯誤？
A. 若肝穿刺檢體太小將無法提供足夠的資訊，檢體⻑度應至少達到0.5 cm
B. 慢性C型肝炎引起的纖維化，初始階段常發生於portal及periportal area（zone 1）
C. 非酒精性脂肪肝病引起的纖維化，初始階段好發於中心肝小靜脈（central perivenular）附近（zone 3）
D. 嚴重腹水或是凝血功能異常延⻑時不能進行肝穿刺檢查

正確答案：A. 若肝穿刺檢體太小將無法提供足夠的資訊，檢體⻑度應至少達到0.5 cm